35歲男性，因父親被診斷為具傳染性的肺結核感染，而被轉介至門診進行評估。沒有臨床症狀，血清丙型干擾素釋放測試（Interferon-gamma releasing assays, IGRAs）檢查為陽性，下列何種處置不恰當？
A. 照胸部X光，排除活動性肺結核（active TB）
B. 照胸部X光，有病變則進行痰液結核菌抹片及培養
C. 照胸部X光，若無病變則依潛伏性結核（latent tuberculosis）治療
D. 負壓隔離病室隔離

正確答案：D. 負壓隔離病室隔離